¿Cómo definiría calidad asistencial?
1. La calidad asistencial es el conjunto de normas para asegurar que se hacen las cosas bien.
2. La calidad asistencial se puede definir como la ausencia de incidentes en el cuidado a los enfermos.
3. La calidad asistencial puede definirse como la satisfacción de las necesidades y aspiraciones de los enfermos-clientes, tanto reales como percibidas, con el menor consumo de recursos.
4. La calidad asistencial se define a través de la implantación de las acciones de mejora que aseguran cumplir con los objetivos del Plan de Calidad del Centro Sanitario.
5. La calidad asistencial es tratar a los enfermos con todos los medios posibles.

Respuesta correcta: 3. La calidad asistencial puede definirse como la satisfacción de las necesidades y aspiraciones de los enfermos-clientes, tanto reales como percibidas, con el menor consumo de recursos.